Clinical trial exclusion criteria:
Patients with second primary cancer, except:adequately treated non-melanoma skin cancer, curatively treated in-situ cancer of the cervix, or other solid tumor curatively treated with no evidence of disease for <= 5 years.
Has known active central nervous system(CNS) metastases
Has an active infection requiring systemic therapy
Pregnancy or breast feeding
Patients with cardiac problem
Any previous treatment with sunitinib

Annotated entities:
- Qualifier: "second"
- Condition: "primary cancer,"
- Negation: "except"
- Condition: "non-melanoma skin cancer"
- Condition: "in-situ cancer of the cervix"
- Condition: "solid tumor"
- Non-query-able: "solid tumor curatively treated with no evidence of disease for <= 5 years."
- Mood: "treated"
- Mood: "treated"
- Condition: "metastases"
- Qualifier: "central nervous system"
- Qualifier: "CNS"
- Condition: "active infection"
- Pregnancy_considerations: "Pregnancy or breast feeding"
- Condition: "cardiac problem"
- Drug: "sunitinib"